Clinical trial exclusion criterion:
Prior invasive malignancy during the past 3 years other than non-melanomatous skin cancer. Note: Patients with prior surgically-cured malignancies [eg, stage I breast cancer or prostate cancer, in-situ carcinoma of the cervix, etc] are not excluded; however, sponsor approval must be obtained before patient is randomized.

Entity relations:
- Has_negation("non-melanomatous skin cancer", "other than")
- Has_qualifier("malignancy", "invasive")
- Has_temporal("malignancy", "during the past 3 years")
- Has_negation("surgically-cured malignancies", "are not")
- Has_temporal("malignancy", "Prior")